有一位 70 歲女性抱怨她在最近 3 個月咳嗽時會有嚴重尿失禁的現象。身體檢查並無異常，病史追蹤發現她大約 3-4 個月前開始長期服用一些心臟血管方面的藥物，下面那一種藥最可能是造成尿失禁惡化的主要因素？
A. captopril
B. doxazosin
C. felodipine
D. propranolol

正確答案：B. doxazosin